Clinical trial exclusion criteria:
Non survivable injury
Multiple significant trauma (i.e. significant intracranial and extracranial injuries including limb fractures) that would limit observation of recovery from spinal cord injury
Other conditions that would limit clinical assessment of outcomes (e.g. dementia, demyelinating disease, autoimmune disease, etc)
Refusal of treatment or contraindication to NeuroAiD

Annotated entities:
- Condition: "injury"
- Qualifier: "Non survivable"
- Condition: "trauma"
- Qualifier: "Multiple"
- Qualifier: "significant"
- Condition: "extracranial injuries"
- Condition: "intracranial injuries"
- Condition: "limb fractures"
- Condition: "dementia"
- Condition: "demyelinating disease"
- Condition: "autoimmune disease"
- Condition: "contraindication"
- Procedure: "NeuroAiD"